Clinical trial exclusion criterion:
Epiretinal membrane and/or vitreomacular traction in the study eye as determined by the central reading center.

Annotated entities:
- Condition: "Epiretinal membrane traction"
- Condition: "vitreomacular traction"
- Qualifier: "in the study eye"
- Non-representable: "as determined by the central reading center"